下列何種方法用來決定輪椅的高度？
A. 以小腿長度作標準
B. 以下肢二分之一之長度作標準
C. 以腳底至膕部（popliteal area）長度加 2 吋作標準
D. 以身高四分之一作標準

正確答案：C. 以腳底至膕部（popliteal area）長度加 2 吋作標準